Clinical trial exclusion criterion:
Possible pregnancy (confirmed by urine test)

Annotated entities:
- Condition: "pregnancy"
- Mood: "Possible"
- Procedure: "urine test"
- Value: "confirmed"